Clinical trial inclusion criterion:
Endoscopic and surgical treatment to be provided by same team

Entity relations:
- OR("Endoscopic treatment", "surgical treatment")